Clinical trial exclusion criteria:
Revision cases
Uncontrolled bleeding tendency (prothrombin conc. Less than 70%)
History of deep venous thrombosis
Sever liver impairment (liver failure)
Sever renal impairment (S. creatinine more than 3)

Annotated entities:
- Observation: "Revision cases"
- Qualifier: "Uncontrolled"
- Condition: "bleeding tendency"
- Measurement: "prothrombin"
- Value: "Less than 70%"
- Condition: "deep venous thrombosis"
- Temporal: "History"
- Qualifier: "Sever"
- Condition: "liver impairment"
- Condition: "liver failure"
- Qualifier: "Sever"
- Condition: "renal impairment"
- Measurement: "creatinine"
- Value: "more than 3"